Clinical trial exclusion criterion:
Use of a fibrinolytic agent, surgical thrombectomy, interventional (catheter-directed) thrombus aspiration or lysis, or use of a cava filter to treat the index episode of PE

Annotated entities:
- Drug: "fibrinolytic agent"
- Procedure: "surgical thrombectomy,"
- Procedure: "thrombus aspiration"
- Procedure: "thrombus lysis"
- Procedure: "cava filter"
- Condition: "PE"